Clinical trial exclusion criterion:
History of atrial fibrillation or muscle disease (myopathy)

Entity relations:
- Subsumes("muscle disease", "myopathy")
- OR("atrial fibrillation", "muscle disease")